Clinical trial inclusion criterion:
mean blood pressure more than 60mmHg

Entity relations:
- Has_value("mean blood pressure", "more than 60mmHg")